Clinical trial exclusion criterion:
History of bladder irradiation

Entity relations:
- Has_temporal("bladder irradiation", "History")